At least two of the following additional criteria

The above is a clinical trial inclusion criterion. Annotated with entity spans:
[Non-representable: At least two of the following additional criteria]